one licensed NNRTI or boosted protease inhibitor

The above is a clinical trial inclusion criterion. Annotated with entity spans:
[Multiplier: one] [Qualifier: licensed] [Drug: NNRTI] or [Drug: boosted protease inhibitor]